23歲男性，因癲癇服用carbamazepine，經兩周後，全身皮膚黏膜產生大面積水泡及破皮，經皮膚科醫師診斷為毒性表皮溶解症（toxic epidermal necrolysis），此病人的HLA-B基因型，最可能為下列何者？
A. HLA-B*1502
B. HLA-B*1301
C. HLA-B*5802
D. HLA-B*5801

正確答案：A. HLA-B*1502